Clinical trial exclusion criterion:
Hepatic insufficiency

Annotated entities:
- Condition: "Hepatic insufficiency"